Clinical trial exclusion criterion:
Women who are pregnant (as evidenced by pregnancy test if pre-menopausal)

Entity relations:
- AND("pre-menopausal", "pregnancy test")
- AND("pregnant", "pre-menopausal")